Meets Diagnostic and Statistical Manual of Mental Disorders, 5th Edition (DSM-5) criteria for any Substance Use Disorder except caffeine-related disorders, or tobacco-related disorders.

The above is a clinical trial exclusion criterion. Annotated with entity spans:
[Value: Meets] [Measurement: Diagnostic and Statistical Manual of Mental Disorders, 5th Edition (DSM-5) criteria] for any [Condition: Substance Use Disorder] [Negation: except] [Condition: caffeine-related disorders], or [Condition: tobacco-related disorders].